Diagnosis of Heart Failure;

The above is a clinical trial inclusion criterion. Annotated with entity spans:
Diagnosis of [Condition: Heart Failure];